Clinical trial exclusion criterion:
seizures or epilepsy in the past

Entity relations:
- Has_temporal("seizures", "in the past")
- OR("seizures", "epilepsy")